Creatinine clearance (CLcr) = 60 mL /min, as calculated by the Cockcroft-Gault equation

The above is a clinical trial inclusion criterion. Annotated with entity spans:
[Measurement: Creatinine clearance (CLcr)] [Value: = 60 mL /min], as calculated by the [Qualifier: Cockcroft-Gault equation]